Se ha transcrito y además se traduce:
1. mRNA.
2. rRNA.
3. Intrones.
4. tRNA.
5. Promotor.

Respuesta correcta: 1. mRNA.